Clinical trial exclusion criteria:
On systemic antibiotics or with an active bacterial infection at the time of surgery
Patients previously enrolled in this trial
Patients known to be colonized with Methicillin-resistant S. aureus (MRSA)(unethical not to administer glycopeptides), beta-lactam or vancomycin allergy precluding the use of cefazolin or vancomycin, respectively, or to silver precluding the use of Prevena
Participation in other studies that may interfere with this trial

Annotated entities:
- Drug: "systemic antibiotics"
- Condition: "bacterial infection"
- Qualifier: "active"
- Temporal: "at the time of surgery"
- Reference_point: "the time of surgery"
- Procedure: "surgery"
- Observation: "previously enrolled in this trial"
- Qualifier: "Methicillin-resistant S. aureus (MRSA)"
- Condition: "colonized"
- Non-representable: "(unethical not to administer glycopeptides)"
- Drug: "beta-lactam"
- Drug: "vancomycin"
- Condition: "allergy"
- Drug: "cefazolin"
- Drug: "vancomycin"
- Drug: "silver"
- Competing_trial: "Participation in other studies that may interfere with this trial"